Presence or recent history of major depressive disorder, bipolar disorder, psychotic disorder, or generalized anxiety disorder requiring therapy.

The above is a clinical trial exclusion criterion. Annotated with entity spans:
Presence or recent [Temporal: history] of [Condition: major depressive disorder], [Condition: bipolar disorder], [Condition: psychotic disorder], or [Condition: generalized anxiety disorder] [Qualifier: requiring therapy].